Clinical trial exclusion criterion:
Current intake of antibiotics or end of antibiotic therapy <8 days before first IMP administration

Annotated entities:
- Drug: "antibiotics"
- Temporal: "Current"
- Multiplier: "end of"
- Procedure: "antibiotic therapy"
- Temporal: "<8 days before first IMP administration"
- Reference_point: "first IMP administration"